Clinical trial exclusion criterion:
known allergy to tranexamic acid/Cyklokapron®

Annotated entities:
- Condition: "allergy"
- Drug: "tranexamic acid"
- Drug: "Cyklokapron"